Hepatitis B surface antigen positive

The above is a clinical trial exclusion criterion. Annotated with entity spans:
[Measurement: Hepatitis B surface antigen] [Value: positive]